Patient or parent/guardian capable of providing informed consent

The above is a clinical trial inclusion criterion. Annotated with entity spans:
[Post-eligibility: Patient or parent/guardian capable of providing informed consent]